What are the prednisone side effects in DMD patients?

Side effects of prednisone in DMD patients include reduced growth rate and increase in body weight.